屈指深肌（flexor digitorum profundus）的肌腱附	於下列何者？
A. 遠端指骨（distal phalange）
B. 中端指骨（middle phalange）
C. 近端指骨（proximal phalange）
D. 腕骨（metacarpal）

正確答案：A. 遠端指骨（distal phalange）